Clinical trial exclusion criterion:
Previous uterine surgery.

Annotated entities:
- Temporal: "Previous"
- Procedure: "uterine surgery"